下列那一種健康保險支付制度，比較不會誘導醫師篩選病情較輕的病人？
A. 論質計酬
B. 論量計酬
C. 論人計酬
D. 論病例計酬

正確答案：B. 論量計酬